有關甘油-3-磷酸穿梭路徑（glycerol 3-phosphate shuttle）之敘述，下列何者正確？
A. 此穿梭路徑將細胞質的 NADH 穿過粒線體內膜運送至間質（matrix）而得到 3ATP / NADH
B. 此穿梭路徑可將細胞質的NADH轉換為NAD+，同時在粒線體生成FADH2
C. 此穿梭路徑不需要粒線體甘油-3-磷酸脫氫酶（mitochondrial glycerol 3-phosphate dehydrogenase）的參與
D. 此穿梭路徑需要蘋果酸脫氫酶（malate dehydrogenase）的參與

正確答案：B. 此穿梭路徑可將細胞質的NADH轉換為NAD+，同時在粒線體生成FADH2